Patients will be excluded if they have known middle ear disease, chronic lung disease or claustrophobia

The above is a clinical trial exclusion criterion. Annotated with entity spans:
Patients will be excluded if they have known [Condition: middle ear disease], [Condition: chronic lung disease] or [Condition: claustrophobia]